Clinical trial inclusion criterion:
Women (18-75 years) with suspected UTI

Entity relations:
- Has_qualifier("UTI", "suspected")
- Has_value("years", "18-75")
- AND("Women", "UTI")
- AND("years", "UTI")